18-85 years of age, inclusive;

The above is a clinical trial inclusion criterion. Annotated with entity spans:
[Value: 18-85 years] of [Person: age], inclusive;